Clinical trial exclusion criterion:
Previous incontinence surgery

Annotated entities:
- Procedure: "incontinence surgery"